Clinical trial exclusion criterion:
Patients with any contraindications or hypersensitivity related to antiplatelet therapy

Entity relations:
- AND("contraindications", "antiplatelet therapy")
- OR("contraindications", "hypersensitivity")